Clinical trial exclusion criterion:
clinically relevant pathologies (eg: pulmonary illness, cardiovascular illness; evolutive cancer, neurological illness, blood illness….)

Annotated entities:
- Condition: "pulmonary illness"
- Condition: "cardiovascular illness"
- Condition: "evolutive cancer"
- Condition: "neurological illness"
- Condition: "blood illness"
- Context_Error: "clinically relevant pathologies (eg: pulmonary illness, cardiovascular illness; evolutive cancer, neurological illness, blood illness….)"